下列有關懷孕對血行動力學及血壓的影響敘述，何者錯誤？
A. 懷孕期間，心輸出量增加約40%
B. 懷孕期間，週邊血管阻力增加
C. 懷孕期間，心跳加快
D. 懷孕期間，血壓測量（連續二次，相隔超過 6 小時）超過140/90 mmHg為不正常

正確答案：B. 懷孕期間，週邊血管阻力增加